1. Diagnosis: Diagnosis of CP secondary to neuronal migration.

The above is a clinical trial exclusion criterion. Annotated with entity spans:
[Parsing_Error: 1.] Diagnosis: Diagnosis of [Condition: CP secondary to neuronal migration].